一位 50 歲男性因為 B 型肝炎相關肝硬化合併大量腹水住院治療，經利尿劑及幾次大量腹水放液術治療後，小便量及 glomerular filtration rate 明顯減少，最適當的治療為何？
A. propranolol
B. fluid supply
C. 增加利尿劑劑量
D. 考慮肝臟移植

正確答案：B. fluid supply